Any chronic medical illness or condition that contraindicates a surgical procedure under general anesthesia, as judged by the clinical study Investigator

The above is a clinical trial exclusion criterion. Annotated with entity spans:
Any chronic medical illness or condition that [Condition: contraindicates] a [Procedure: surgical procedure] under [Procedure: general anesthesia], as judged by the clinical study Investigator